Clinical trial exclusion criterion:
Patients with important organ dysfunctions.

Annotated entities:
- Condition: "organ dysfunctions"